Clinical trial exclusion criterion:
Intolerability of tamsulosin or related drugs

Entity relations:
- AND("Intolerability", "tamsulosin")
- OR("tamsulosin", "related drugs")